Clinical trial inclusion criteria:
Patients undergoing thoracic aorta surgery with hypothermic circulatory arrest, over 20-of age

Annotated entities:
- Qualifier: "thoracic aorta"
- Procedure: "surgery"
- Condition: "hypothermic circulatory arrest"
- Person: "age"
- Value: "over 20"